Clinical trial exclusion criterion:
Acute illness or active systemic infection or sepsis

Annotated entities:
- Condition: "systemic infection"
- Condition: "sepsis"
- Non-query-able: "Acute illness"